Clinical trial inclusion criterion:
patients undergoing partial or full resection of the pancreas due to a benign or malignant tumor

Entity relations:
- AND("full resection of the pancreas", "benign tumor")
- AND("full resection of the pancreas", "partial resection of the pancreas")
- OR("benign tumor", "malignant tumor")